Current pulmonary exacerbation thought to be due to allergic bronchopulmonary aspergillosis (ABPA)

The above is a clinical trial exclusion criterion. Annotated with entity spans:
Current [Condition: pulmonary exacerbation] thought to be due to [Condition: allergic bronchopulmonary aspergillosis] ([Condition: ABPA])